Clinical trial exclusion criterion:
Infiltration or previous surgery in the area

Annotated entities:
- Procedure: "previous surgery"
- Condition: "Infiltration"